Contraindications to study drugs

The above is a clinical trial exclusion criterion. Annotated with entity spans:
[Condition: Contraindications] to [Drug: study drugs]